Agree to be washed-out for two weeks if receiving SSRI, SNRI or NASA.

The above is a clinical trial inclusion criterion. Annotated with entity spans:
Agree to be [Procedure: washed-out] [Temporal: for two weeks] if receiving [Procedure: SSRI], [Procedure: SNRI] or [Procedure: NASA].